¿Cómo se denominan los productos farmacéuticos con el mismo principio activo en los que la dosis y forma de dosificación son diferentes?:
1. Productos genéricos.
2. Equivalentes farmacéuticos.
3. Alternativas farmacéuticas.
4. Productos biosimilares.

Respuesta correcta: 3. Alternativas farmacéuticas.